La apoptosis es:
1. La senescencia celular.
2. Una forma de muerte celular programada.
3. La migración celular.
4. Un modo de reprogramación celular.
5. El proceso de diferenciación celular.

Respuesta correcta: 2. Una forma de muerte celular programada.